Clinical trial inclusion criterion:
NYHA III:Marked limitation of physical activity. Comfortable at rest, but less than ordinary activity causes undue breathlessness, fatigue or palpitation.

Annotated entities:
- Non-query-able: "NYHA III:Marked limitation of physical activity. Comfortable at rest, but less than ordinary activity causes undue breathlessness, fatigue or palpitation"